Un electrodo selectivo de calcio se caracteriza por tener:
1. Una membrana que es un cristal sólido.
2. Una disolución interna de HCl 0.1 M.
3. Un electrodo interno de plata.
4. Una membrana de sales de plata.
5. Una disolución acuosa interna de CaCl2 saturada de AgCl.

Respuesta correcta: 5. Una disolución acuosa interna de CaCl2 saturada de AgCl.